傳統輻射劑量的單位是 rad，現代單位是 Gray（Gy），下列那項是正確的換算方法？
A. 1 rad = 10 Gy
B. 1 rad = 100 Gy
C. 1 Gy = 1000 rad
D. 1 Gy = 100 rad

正確答案：D. 1 Gy = 100 rad